Clinical trial exclusion criterion:
Involved in workers' compensation or active litigation involving affected shoulder

Annotated entities:
- Non-query-able: "Involved in workers' compensation or active litigation involving affected shoulder"